Clinical trial exclusion criterion:
Suspected current drug or alcohol abuse

Annotated entities:
- Condition: "alcohol abuse"
- Condition: "drug abuse"
- Observation: "Suspected"
- Temporal: "current"